Un factor importante a tener en cuenta en los fármacos de elevado grado de unión a la albúmina plasmática es la concentración de esta proteína. Señale en cuál de los siguientes supuestos la concentración de albúmina plasmática se encuentra reducida:
1. Hipotiroidismo.
2. Neurosis.
3. Psicosis.
4. Mieloma múltiple.
5. Esquizofrenia.

Respuesta correcta: 4. Mieloma múltiple.